Clinical trial exclusion criterion:
history of hypersensitivity to test drugs

Entity relations:
- AND("hypersensitivity", "test drugs")
- Has_temporal("hypersensitivity", "history of")